Clinical trial inclusion criterion:
Bilirubin/ SGOT/SGPT < 5 × upper normal limits.

Annotated entities:
- Measurement: "Bilirubin"
- Measurement: "SGOT"
- Measurement: "SGPT"
- Value: "< 5 × upper normal limits"